In which diseases have electronic patient diaries been applied ?

Parkinson's disease
COPD
Food hypersensitivity
Niacin induced flushing
Hemophilia
Heartburn
Headache